Clinical trial exclusion criterion:
Non-English speaking/illiterate

Annotated entities:
- Post-eligibility: "Non-English speaking/illiterate"